Medical examination performed prior to participation in research

The above is a clinical trial inclusion criterion. Annotated with entity spans:
[Procedure: Medical examination] performed [Temporal: prior to participation in research]